Clinical trial exclusion criterion:
Serious, uncontrolled, non-malignant illness

Entity relations:
- Has_qualifier("non-malignant illness", "uncontrolled")
- Has_qualifier("non-malignant illness", "Serious")